Clinical trial exclusion criterion:
Atypical Parkinsonian Syndromes

Entity relations:
- Has_qualifier("Parkinsonian Syndromes", "Atypical")